Female gender

The above is a clinical trial inclusion criterion. Annotated with entity spans:
[Person: Female] gender